17 歲的小茹因斷斷續續發燒、咳嗽數星期、體重減輕、容易疲累，而住到醫院接受一連串的檢查，最後證實小茹罹患惡性淋巴瘤。小茹的父母要求醫師不要讓她知道此診斷，而告訴她罹患的是肺炎。 下列何敘述最恰當？
A. 醫師應體諒小茹父母的苦心，協助隱瞞小茹的病情
B. 小茹尚未成年，故不能參與討論她的治療計畫
C. 主治醫師仍需探知小茹的能力與意願，並會同社工師進行家庭懇談
D. 醫師不應欺騙病人，可以用請她轉院的手段，使小茹父母同意醫師告知小茹她的病情

正確答案：C. 主治醫師仍需探知小茹的能力與意願，並會同社工師進行家庭懇談